Which gene is mutated in a subtype of arrhythmogenic right ventricular cardiomyopathy known as Naxos disease?

A homozygous loss-of-function mutation of the Plakoglobin (Jup) gene, which encodes a major component of the desmosome and the adherens junction, had been identified in Naxos patients, although the underlying mechanism remained elusive.